with any approved TAVI device

The above is a clinical trial inclusion criterion. Annotated with entity spans:
with any approved [Device: TAVI device]